Clinical trial exclusion criterion:
sleep disordered breathing (diagnosed OSA, obesity hypoventilation syndrome)

Annotated entities:
- Condition: "sleep disordered breathing"
- Condition: "OSA"
- Condition: "obesity hypoventilation syndrome"